Clinical trial exclusion criterion:
Allergic to the medications

Annotated entities:
- Condition: "Allergic"
- Drug: "medications"